Clinical trial exclusion criterion:
Presence of any other disease with a life expectancy of <5 years.

Annotated entities:
- Observation: "life expectancy"
- Value: "<5 years"
- Condition: "disease"
- Qualifier: "any other"